Renal insufficiency (Creatinine clearance < 30 mL/min)

The above is a clinical trial exclusion criterion. Annotated with entity spans:
[Condition: Renal insufficiency] ([Measurement: Creatinine clearance] [Value: < 30 mL/min])